Clinical trial inclusion criterion:
ECOG PS of 0-2;

Annotated entities:
- Measurement: "ECOG PS"
- Value: "0-2"